What is the mechanism of action of Ivosidenib?

Ivosidenib is an inhibitor of the IDH1 mutant enzyme that exhibits profound 2-HG lowering in tumor models. It is effective for IDH1-mutant relapsed/refractory acute myeloid leukemia.